previous treatment with follicle stimulating hormone for assisted reproduction

The above is a clinical trial exclusion criterion. Annotated with entity spans:
[Temporal: previous] [Procedure: treatment] with [Drug: follicle stimulating hormone] for [Procedure: assisted reproduction]